Son receptores involucrados en la fagocitosis dependiente de opsonización:
1. KIR.
2. TLR1.
3. MR.
4. CR1.
5. TCR.

Respuesta correcta: 4. CR1.